Previous propofol infusion rate >4 mg/kg/h

The above is a clinical trial exclusion criterion. Annotated with entity spans:
[Temporal: Previous] [Measurement: propofol infusion rate] [Value: >4 mg/kg/h]